Patients with eyebrow tatoos

The above is a clinical trial exclusion criterion. Annotated with entity spans:
Patients with [Observation: eyebrow tatoos]